下列何種病毒，其核酸為雙鏈負股 RNA，經由糞口途徑傳染，發病初期出現如感冒樣症狀，發燒、嘔吐、咳嗽、流鼻水，1 至 2 天後會造成腸黏膜發炎、絨毛萎縮，這時候會出現水瀉，有如蛋花湯般的水便？
A. 輪狀病毒（Rotavirus）
B. 腸病毒 71 型（EV71）
C. 鼻病毒（Rhinovirus）
D. 小兒麻痺病毒（Poliovirus）

正確答案：A. 輪狀病毒（Rotavirus）